冠狀動脈繞道手術時，所使用的導管（Conduit）有許多種，長期追蹤後，通暢率最佳的是：
A. 內乳動脈
B. 大隱靜脈
C. 橈骨動脈（radial artery）
D. 右胃網膜動脈（right gastroepiploic artery）

正確答案：A. 內乳動脈